Clinical trial inclusion criterion:
ASIA A,B,C, or D

Annotated entities:
- Measurement: "ASIA"
- Value: "A,B,C, or D"